Ever having received oral cholera vaccine.

The above is a clinical trial exclusion criterion. Annotated with entity spans:
Ever having received [Drug: oral cholera vaccine].